Severe intercurrent infection

The above is a clinical trial exclusion criterion. Annotated with entity spans:
[Qualifier: Severe] [Temporal: intercurrent] [Condition: infection]